Liver disease (abnormal liver enzymes)

The above is a clinical trial exclusion criterion. Annotated with entity spans:
[Condition: Liver disease] ([Value: abnormal] [Measurement: liver enzymes])